Clinical trial inclusion criterion:
first upper GI endoscopy procedure

Annotated entities:
- Multiplier: "first"
- Qualifier: "upper GI"
- Procedure: "endoscopy procedure"